下列何者非 obstructive sleep apnea 之常見臨床表現？
A. 肥胖（obesity）
B. 打鼾（snoring）
C. 高血壓（hypertension）
D. 耳鳴（tinnitus）

正確答案：D. 耳鳴（tinnitus）